physical limitations that might be aggravated by moderate physical activity

The above is a clinical trial exclusion criterion. Annotated with entity spans:
[Condition: physical limitations] that might be [Qualifier: aggravated by] [Qualifier: moderate] physical activity